Clinical trial exclusion criterion:
Significant leucopenia, neutropenia, thrombocytopenia, anemia, or known bleeding diathesis

Annotated entities:
- Condition: "leucopenia"
- Condition: "neutropenia"
- Condition: "thrombocytopenia"
- Condition: "anemia"
- Condition: "bleeding diathesis"
- Qualifier: "Significant"